Diagnosis of heart failure according to Framingham criteria

The above is a clinical trial inclusion criterion. Annotated with entity spans:
Diagnosis of [Condition: heart failure] according to [Qualifier: Framingham criteria]